Patients should have at least 12 teeth present

The above is a clinical trial inclusion criterion. Annotated with entity spans:
Patients should have [Multiplier: at least 12] [Condition: teeth present]